Clinical trial inclusion criterion:
MRSA on a baseline blood culture and on at least 1 additional blood culture after at least 72 hours of vancomycin and/or daptomycin treatment (Cohort B).

Annotated entities:
- Observation: "MRSA"
- Procedure: "blood culture"
- Temporal: "baseline"
- Multiplier: "at least 1 additional"
- Procedure: "blood culture"
- Temporal: "after at least 72 hours of vancomycin and/or daptomycin treatment"
- Reference_point: "vancomycin and/or daptomycin treatment"
- Drug: "vancomycin"
- Drug: "daptomycin"
- Procedure: "daptomycin treatment"
- Procedure: "vancomycin treatment"